Describe the application of whole genome sequencing in the diagnosis of primary ciliary dyskinesia (PCD)

WGS is effective in cases where prior gene panel testing has found no variants or only heterozygous variants.